法勒氏四聯症（tetralogy of Fallot）中之跨騎主動脈（overriding aorta）症，其成因應為：
A. 球（bulbar ridge）及動脈幹（truncal ridge）尚未分隔動脈幹
B. 心室間隔（interventricular septum）之缺損
C. 動脈導管之異常閉鎖
D. 第一中隔（septum primum）未與心內膜墊相融合

正確答案：B. 心室間隔（interventricular septum）之缺損